Clinical trial exclusion criterion:
Has any clinically significant condition or situation that would interfere with the trial evaluations or participation in the trial

Annotated entities:
- Post-eligibility: "Has any clinically significant condition or situation that would interfere with the trial evaluations or participation in the trial"